Clinical trial inclusion criterion:
If female, willing to use contraception throughout the study

Annotated entities:
- Person: "female"
- Procedure: "contraception"
- Temporal: "throughout the study"